active infection

The above is a clinical trial exclusion criterion. Annotated with entity spans:
[Qualifier: active] [Condition: infection]